Clinical trial inclusion criterion:
An Eastern Cooperative Oncology Group (ECOG) performance status of 0 or 1

Entity relations:
- Subsumes("Eastern Cooperative Oncology Group performance status", "ECOG")
- Has_value("Eastern Cooperative Oncology Group performance status", "0 or 1")